Clinical trial exclusion criterion:
Subjects admitted for trauma surgery

Annotated entities:
- Procedure: "trauma surgery"